Clinical trial inclusion criterion:
Medically stable

Entity relations:
- Has_qualifier("stable", "Medically")